Clinical trial exclusion criterion:
Congenital Cyanotic heart disease

Annotated entities:
- Qualifier: "Congenital"
- Condition: "Cyanotic heart disease"